Clinical trial exclusion criterion:
Patients taking B-blockers or Ca channel blockers.

Entity relations:
- OR("B-blockers", "Ca channel blockers")